Clinical trial exclusion criterion:
Suspected cervical vertebral column injury necessitating using a neck collar.

Annotated entities:
- Condition: "cervical vertebral column injury"
- Mood: "Suspected"